下列有關胰島素作用之敘述，何者正確？
A. 與細胞膜接受體（receptor）結合後，活化接受體之絲胺基酸激（serine kinase）
B. 活化肝醣合成激三（GSK-3）
C. 刺激葡萄糖轉運蛋白（glucose transporter）由小泡（vesicle）送到細胞膜
D. 形成複合體穿越細胞膜轉送到粒線體（mitochondria）

正確答案：C. 刺激葡萄糖轉運蛋白（glucose transporter）由小泡（vesicle）送到細胞膜